Clinical trial exclusion criterion:
Allergic reaction to poultry or previous viscosupplementation

Entity relations:
- Has_context("Allergic reaction", "poultry")
- OR("poultry", "viscosupplementation")